Established Osteoarthritis (Kellgren-Lawrence > 3)

The above is a clinical trial exclusion criterion. Annotated with entity spans:
Established [Condition: Osteoarthritis] ([Measurement: Kellgren-Lawrence] [Value: > 3])